Under lamivudine/adefovir treatment for more than 1 year due to previous lamivudine resistance (LAM-R), current HBV DNA is undetectable (< 20 IU/ml) during enrollment.

The above is a clinical trial inclusion criterion. Annotated with entity spans:
Under [Drug: lamivudine]/[Drug: adefovir] treatment for [Temporal: more than 1 year] due to previous [Observation: lamivudine resistance] ([Observation: LAM-R]), current [Measurement: HBV DNA] is [Value: undetectable] ([Value: < 20 IU/ml]) [Temporal: during enrollment].